Active opioid dependence

The above is a clinical trial exclusion criterion. Annotated with entity spans:
[Qualifier: Active] [Condition: opioid dependence]